Clinical trial inclusion criterion:
6. Bilirubin <2x, AST <3x, Serum creatinine <2x upper limit of normal, Hgb >8.0

Annotated entities:
- Parsing_Error: "6."
- Measurement: "Bilirubin"
- Value: "<2x"
- Measurement: "AST"
- Value: "<3x"
- Measurement: "Serum creatinine"
- Value: "<2x upper limit of normal"
- Measurement: "Hgb"
- Value: ">8.0"